Bilirubin <1.25 times the upper limit of normal (ULN)

The above is a clinical trial inclusion criterion. Annotated with entity spans:
[Measurement: Bilirubin] [Value: <1.25 times the upper limit of normal] (ULN)